No current treatment plan at OHSU

The above is a clinical trial exclusion criterion. Annotated with entity spans:
[Negation: No] [Temporal: current] [Mood: treatment plan] at [Visit: OHSU]